Midsubstance pain in the achilles tendon

The above is a clinical trial inclusion criterion. Annotated with entity spans:
[Condition: Midsubstance pain] in the [Qualifier: achilles tendon]